Clinical trial exclusion criterion:
Patients who have Tacrolimus trough level resulted as 2 ng/mg at the baseline.

Entity relations:
- Has_value("Tacrolimus", "2 ng/mg")